Clinical trial exclusion criterion:
Pregnant or lactating females.

Annotated entities:
- Condition: "Pregnant"
- Condition: "lactating"
- Person: "females"